下列何項不是 cyclophosphamide 常見的副作用？
A. 抑制骨髓
B. 出血性膀胱炎
C. 周邊神經病變
D. 噁心嘔吐

正確答案：C. 周邊神經病變